就全世界的人口統計而論，下列那一項疾病被認為是造成5歲以下兒童死亡最重要的單項死因？
A. Acute respiratory infection
B. Asthma
C. Ischemic heart disease
D. Tuberculosis

正確答案：A. Acute respiratory infection